Revision total knee arthroplasty

The above is a clinical trial exclusion criterion. Annotated with entity spans:
[Procedure: Revision total knee arthroplasty]